¿Qué ARN Polimerasa eucariota está implicada en la transcripción del ARN mensajero (ARNm)?:
1. ARN Polimerasa I.
2. ARN Polimerasa II.
3. ARN Polimerasa III.
4. ARN Polimerasa IV.
5. La transcripción del ARNm se lleva a cabo de manera conjunta por la ARN Polimerasa I y ARN Polimerasa II.

Respuesta correcta: 2. ARN Polimerasa II.